下列腫瘤侵襲（Invasion）的四個階段，請自先而後排出順序：①腫瘤細胞移動（Migration of tumor cells） ②附著於基質（Attachment to matrix components） ③腫瘤細胞相互脫離（Dettachment of tumor cells from each other） ④分解細胞外母質（Degradation of extracellular matrix）
A. ①②③④
B. ④③①②
C. ②③①④
D. ③②④①

正確答案：D. ③②④①